Currently living in a stable environment

The above is a clinical trial inclusion criterion. Annotated with entity spans:
Currently [Observation: living in a stable environment]